Willingness and ability to comply with scheduled visits, treatment plans and any other study procedures

The above is a clinical trial inclusion criterion. Annotated with entity spans:
[Mood: Willingness] and [Mood: ability to comply with scheduled visits], treatment plans and any other study procedures